45 歲男性身體檢查發現二尖瓣脫垂（Mitral valve prolapse）及閉鎖不全（Mitral insufficiency），其瓣膜最可能的病理變化是：
A. Fibrosis with commissural fusion
B. Fibrinoid necrosis
C. Myxomatous degeneration
D. Calcification

正確答案：C. Myxomatous degeneration